Clinical trial exclusion criterion:
Use of warfarin is prohibited. Anticoagulation with low-molecular weight heparin (i.e. enoxaparin) or direct thrombin inhibitors is permitted.

Annotated entities:
- Drug: "warfarin"
- Procedure: "Anticoagulation"
- Drug: "low-molecular weight heparin"
- Drug: "enoxaparin"
- Drug: "direct thrombin inhibitors"
- Grammar_Error: "is permitted."